一位65歲男性主訴最近兩星期開始有排尿困難及便秘，三天前因下腹腫脹、疼痛至急診室。經置放導尿管導出800 mL清澈的尿液；今天早上至診所拔除導尿管，到中午仍解不出尿液，來到醫院門診，再置放導尿管後，導出400 mL尿液。身體檢查發現肛門括約肌鬆弛，前列腺中等程度肥大（約60公克左右）。經詢問得知三個月來下背部疼痛並會傳到右腳，下列何者是最適當的檢查或治療？
A. 經尿道前列腺切除手術（TURP）
B. 經直腸超音波及前列腺切片
C. 給予5 alpha還原酶抑制劑
D. 神經學檢查

正確答案：D. 神經學檢查